下列那一選項，最適用於描述非致癌物之風險評估？
A. 劑量反應假設具有閾值存在
B. 使用斜率因子進行風險計算
C. 量化結果一般與10-6比較，以判定風險是否可接受
D. 不適合進行不確定性分析

正確答案：A. 劑量反應假設具有閾值存在